Clinical trial exclusion criterion:
4. Patients with severe cardiopulmonary cerebral disease, and in the failure state

Entity relations:
- Has_qualifier("cardiopulmonary cerebral disease", "severe")